Clinical trial inclusion criterion:
Patients on chronic statin treatment (>30 days) scheduled for isolated CABG, including on- or off-pump or repeat (redo's) revascularisation procedures

Annotated entities:
- Multiplier: "chronic"
- Drug: "statin"
- Procedure: "treatment"
- Value: ">30 days"
- Procedure: "CABG"
- Qualifier: "isolated"
- Mood: "scheduled"
- Procedure: "revascularisation procedures"
- Qualifier: "on- or off-pump or repeat"
- Qualifier: "redo's"